Clinical trial exclusion criterion:
19. Concomitant administration of any herbal medications

Entity relations:
- Has_temporal("herbal medications", "Concomitant")